Clinical trial inclusion criterion:
Healthy as determined by a responsible and experienced physician, based on a medical evaluation including medical history, physical examination, laboratory tests and cardiac monitoring. A subject with a clinical abnormality or laboratory parameter(s) which is/are not specifically listed in the inclusion or exclusion criteria, outside the reference range for the population being studied may be included only if the Investigator in consultation with the GSK Medical Monitor if required agree and document that the finding is unlikely to introduce additional risk factors and will not interfere with the study procedures.

Annotated entities:
- Condition: "Healthy"
- Qualifier: "as determined by a responsible and experienced physician"
- Subjective_judgement: "as determined by a responsible and experienced physician"
- Undefined_semantics: "as determined by a responsible and experienced physician"
- Procedure: "medical evaluation"
- Temporal: "medical history"
- Procedure: "physical examination"
- Procedure: "laboratory tests"
- Procedure: "cardiac monitoring"
- Condition: "clinical abnormality"
- Context_Error: "are not specifically listed in the inclusion or exclusion criteria"
- Value: "outside the reference range"
- Measurement: "laboratory parameter"
- Undefined_semantics: "laboratory parameter"
- Context_Error: "may be included"
- Non-query-able: "A subject with a clinical abnormality or laboratory parameter(s) which is/are not specifically listed in the inclusion or exclusion criteria, outside the reference range for the population being studied may be included only if the Investigator in consultation with the GSK Medical Monitor if required agree and document that the finding is unlikely to introduce additional risk factors and will not interfere with the study procedures."
- Post-eligibility: "A subject with a clinical abnormality or laboratory parameter(s) which is/are not specifically listed in the inclusion or exclusion criteria, outside the reference range for the population being studied may be included only if the Investigator in consultation with the GSK Medical Monitor if required agree and document that the finding is unlikely to introduce additional risk factors and will not interfere with the study procedur"